¿Qué afirmación es correcta respecto a las técnicas objetivas en evaluación psicológica?
1. El Electroencefalógrafo permite recoger respuestas del sistema nervioso somático.
2. El aparato de precisión manual de Purdue permite recoger respuestas del sistema nervioso central.
3. La mayor parte de las respuestas que miden estas técnicas son fácilmente controlables por el evaluado.
4. La administración, registro y puntuación suele realizarse mediante aparatos.
5. El polígrafo permite recoger respuestas cognitivas.

Respuesta correcta: 4. La administración, registro y puntuación suele realizarse mediante aparatos.